風險評估中所使用之危害商數（hazard quotient），主要用於下列那一評估步驟？
A. 危害辨識（hazard identification）
B. 劑量反應評估
C. 暴露評估
D. 風險特徵描述

正確答案：D. 風險特徵描述